Clinical trial inclusion criterion:
Subjects scheduled for laparoscopic unilateral inguinal hernia repair

Entity relations:
- Has_qualifier("inguinal hernia repair", "unilateral")
- Has_qualifier("inguinal hernia repair", "laparoscopic")
- Has_mood("inguinal hernia repair", "scheduled")